Clinical trial exclusion criterion:
Shielding of any part of the esophagus during radiotherapy (including posterior spinal cord shielding)

Annotated entities:
- Qualifier: "esophagus"
- Multiplier: "any part of"
- Procedure: "radiotherapy"
- Procedure: "Shielding"
- Procedure: "posterior spinal cord shielding"